9. self-reported pregnancy

The above is a clinical trial exclusion criterion. Annotated with entity spans:
9. self-reported [Condition: pregnancy]